What is another name for AZD0530?

AZD0530 is also known as saracatinib.